30歲男性病人，主訴有急性視力下降，合併眼睛疼痛至急診就診。下列何者診斷最有可能？
A. 視神經炎（optic neuritis）
B. 中央視網膜動脈阻塞（central retinal artery occlusion）
C. 中央視網膜靜脈阻塞（central retinal vein occlusion）
D. 顳動脈炎（temporal arteritis）

正確答案：A. 視神經炎（optic neuritis）